Un paciente consulta por desarrollo reciente y progresivo de acropaquias y deterioro general. Se inicia la búsqueda de posible neoplasia subyacente. ¿Cuál de los siguientes tumores tiene más posibilidad de ser diagnosticado?
1. Adenocarcinoma gástrico.
2. Epidermoide esofágico.
3. Timoma mediastínico.
4. Folicular de tiroides.
5. Mesotelioma pleural.

Respuesta correcta: 5. Mesotelioma pleural.